Clinical trial exclusion criterion:
previous repair of pectus excavatum by any technique

Entity relations:
- Has_temporal("repair of pectus excavatum", "previous")